Clinical trial inclusion criterion:
male and female patients over the age of 18 years.

Annotated entities:
- Person: "male"
- Person: "female"
- Value: "over 18 years"
- Person: "age"